Clinical trial inclusion criterion:
Idiopathic thrombocytopenic purpura with platelet counts < 50,000, refractory to treatment, in relapse or steroids dependant

Annotated entities:
- Condition: "Idiopathic thrombocytopenic purpura"
- Measurement: "platelet counts"
- Value: "< 50,000"
- Qualifier: "refractory to treatment"
- Drug: "treatment"
- Qualifier: "in relapse"
- Qualifier: "steroids dependant"
- Drug: "steroids"